Known history of hypersensitivity reaction or intolerability to Ace Inh or ARB.

The above is a clinical trial exclusion criterion. Annotated with entity spans:
Known [Temporal: history] of [Condition: hypersensitivity reaction] or [Condition: intolerability] to [Drug: Ace Inh] or [Drug: ARB].